All subjects must have a clinical need for treatment with dapsone that precedes the decision to participate in the study.

The above is a clinical trial inclusion criterion. Annotated with entity spans:
[Non-query-able: All subjects must have a clinical need for treatment with dapsone that precedes the decision to participate in the study].